Why do we use "N-terminal proteomics"?

N-terminal proteomics allows the systematic identification of protease/peptidase cleavage events revealing substrate cleavage specificities.